Have a body mass index (BMI) = 35 kg/m2.

The above is a clinical trial inclusion criterion. Annotated with entity spans:
Have a [Measurement: body mass index (BMI)] [Value: = 35 kg/m2].